dextromethorphan in any form (eg, OTC cold medicines)

The above is a clinical trial exclusion criterion. Annotated with entity spans:
[Drug: dextromethorphan] in [Qualifier: any form] (eg, OTC cold medicines)